Clinical trial inclusion criterion:
Scheduled 1 or 2-level ACDF spine surgery

Annotated entities:
- Qualifier: "2-level"
- Qualifier: "1 -level"
- Procedure: "ACDF spine surgery"